Female with a persisting pregnancy of unknown location:

The above is a clinical trial inclusion criterion. Annotated with entity spans:
[Person: Female] with a persisting [Condition: pregnancy] of [Qualifier: unknown location][Parsing_Error: :]